Clinical trial exclusion criterion:
Presence of a preexisting significant GI condition that does not have a presumed causal relationship with MPA

Annotated entities:
- Condition: "GI condition"
- Temporal: "preexisting"
- Qualifier: "significant"